Clinical trial exclusion criteria:
Known allergy or hypersensitive reaction to dexmedetomidine
Organ dysfunction, and significant developmental delays or behavior problems
Cardiac arrhythmia
Known. acyanotic congenital heart disease or children after cardiac interventional procedures for follow-up examination.

Annotated entities:
- Condition: "allergy"
- Condition: "hypersensitive"
- Drug: "dexmedetomidine"
- Condition: "Organ dysfunction"
- Condition: "developmental delays"
- Qualifier: "significant"
- Condition: "behavior problems"
- Condition: "Cardiac arrhythmia"
- Condition: "acyanotic congenital heart disease"
- Person: "children"
- Temporal: "after cardiac interventional procedures"
- Reference_point: "cardiac interventional procedures"
- Procedure: "cardiac interventional procedures"
- Procedure: "follow-up examination"
- Qualifier: "for follow-up examination"